Treated with anakinra, abatacept, or tocilizumab in the last 6 months

The above is a clinical trial exclusion criterion. Annotated with entity spans:
Treated with [Drug: anakinra], [Drug: abatacept], or [Drug: tocilizumab] [Temporal: in the last 6 months]